Kidney or liver disease or advanced-stage cardiopulmonary

The above is a clinical trial exclusion criterion. Annotated with entity spans:
[Condition: Kidney] or [Condition: liver disease] or [Condition: advanced-stage cardiopulmonary]